In which cell organelle is the SAF-A protein localized?

saf-a/hnrnp u is an abundant nuclear protein that interacts specifically with nuclear matrix attachment region dna